Apparent sensitivity to any of the study peptides as determined by the skin test

The above is a clinical trial exclusion criterion. Annotated with entity spans:
Apparent [Condition: sensitivity] to any of the [Drug: study peptides] as determined by the [Procedure: skin test]